Clinical trial exclusion criterion:
reversible aetiology for agitation (e.g. hypotension, hypoxia, hypoglycaemia)

Entity relations:
- AND("reversible aetiology", "agitation")
- Subsumes("reversible aetiology", "hypotension")
- OR("hypotension", "hypoxia", "hypoglycaemia")